Clinical trial inclusion criteria:
Diagnosis of diabetes mellitus
Best corrected visual acuity 20/32 - 20/320
Diabetic macular edema involving the center of the macula
Optical coherence tomography central subfield thickness of at least 250 microns

Annotated entities:
- Condition: "diabetes mellitus"
- Measurement: "Best corrected visual acuity"
- Value: "20/32 - 20/320"
- Condition: "Diabetic macular edema"
- Qualifier: "center of the macula"
- Measurement: "Optical coherence tomography central subfield thickness"
- Value: "at least 250 microns"